Clinical trial inclusion criterion:
Glycemic control: HbA1c = 10.0%

Entity relations:
- Has_value("HbA1c", "= 10.0%")